Clinical trial inclusion criterion:
History of falls or dizziness at exit from bed in the morning (at least two incidents in the past year)

Annotated entities:
- Condition: "falls"
- Condition: "dizziness"
- Temporal: "at exit from bed in the morning"
- Multiplier: "at least two"
- Condition: "incidents"
- Temporal: "in the past year"